Clinical trial inclusion criterion:
Be categorized as American Society of Anesthesiologists (ASA) Physical Status Class 1, 2, or 3.

Annotated entities:
- Measurement: "American Society of Anesthesiologists (ASA) Physical Status Class"
- Value: "1"
- Value: "2"
- Value: "3"